Clinical trial exclusion criterion:
Babies who have been close to death

Annotated entities:
- Observation: "close to death"
- Temporal: "have been"
- Person: "Babies"